Clinical trial exclusion criterion:
mRS before the autoimmune encephalitis > 3

Annotated entities:
- Condition: "autoimmune encephalitis"
- Temporal: "before the autoimmune encephalitis"
- Reference_point: "the autoimmune encephalitis"
- Measurement: "mRS"
- Value: "> 3"